Clinical trial exclusion criterion:
11. Major surgery within 4 weeks prior to enrollment in the study

Entity relations:
- multi("within 4 weeks prior to enrollment", "enrollment")
- Has_temporal("Major surgery", "within 4 weeks prior to enrollment")